下列那類病人較不容易產生尿酸結石？
A. 痛風（gout）的病人
B. myeloproliferative disorders 的病人
C. 惡性腫瘤接受抗癌藥物治療的病人
D. 神經性膀胱常有尿路感染的病人

正確答案：D. 神經性膀胱常有尿路感染的病人